Clinical trial inclusion criterion:
No contraindication for Pregabalin use

Annotated entities:
- Condition: "contraindication"
- Negation: "No"
- Drug: "Pregabalin"